Clinical trial exclusion criterion:
Blood transfusion within 4 weeks prior to Screening

Annotated entities:
- Procedure: "Blood transfusion"
- Temporal: "within 4 weeks prior to Screening"
- Reference_point: "Screening"